Clinical trial inclusion criteria:
Subjects must be female
Subjects must be 18 years or older
Subjects must be undergoing unilateral or bilateral mastectomy with tissue expander reconstruction

Annotated entities:
- Person: "female"
- Value: "18 years or older"
- Person: "older"
- Qualifier: "unilateral"
- Qualifier: "bilateral"
- Procedure: "mastectomy"
- Procedure: "tissue expander reconstruction"
- Temporal: "undergoing"